Clinical trial inclusion criteria:
Prior Myocardial Infarction and
Sustained monomorphic VT documented on 12-lead ECG or rhythm strip terminated by pharmacologic means or DC cardioversion
=3 episodes of VT treated with antitachycardia pacing (ATP), at least one of which was symptomatic
= 5 episodes of VT treated with antitachycardia pacing (ATP) regardless of symptoms
=1 appropriate ICD shocks,
=3 VT episodes within 24 hours

Annotated entities:
- Condition: "Myocardial Infarction"
- Condition: "monomorphic VT"
- Qualifier: "Sustained"
- Procedure: "12-lead ECG"
- Procedure: "rhythm strip"
- Procedure: "pharmacologic means"
- Procedure: "DC cardioversion"
- Multiplier: "3 episodes"
- Condition: "VT"
- Procedure: "antitachycardia pacing"
- Procedure: "ATP"
- Multiplier: "at least one"
- Qualifier: "symptomatic"
- Multiplier: "5 episodes"
- Condition: "VT"
- Procedure: "antitachycardia pacing"
- Procedure: "ATP"
- Multiplier: "=1"
- Procedure: "ICD shocks"
- Multiplier: "3 episodes"
- Condition: "VT"
- Temporal: "within 24 hours"